Body mass index (BMI) > 34

The above is a clinical trial exclusion criterion. Annotated with entity spans:
[Measurement: Body mass index] ([Measurement: BMI]) [Value: > 34]